Previous diagnosis of collagen disorder

The above is a clinical trial exclusion criterion. Annotated with entity spans:
Previous diagnosis of [Condition: collagen disorder]